Clinical trial exclusion criterion:
Patients experiencing cardiogenic shock

Annotated entities:
- Condition: "cardiogenic shock"